神經管缺損（neural tube defect）的兒童患者，最常影響下列那一個部位的脊椎？
A. 頸椎（cervical level）
B. 胸椎（thoracic level）
C. 胸腰椎（thoracic-lumbar level）
D. 腰薦椎（lumbar-sacral  level）

正確答案：D. 腰薦椎（lumbar-sacral  level）